兒童期特異性慢性關節炎（juvenile idiopathic arthritis, JIA），分成 7 大亞型，有些亞型容易發生慢性葡萄膜炎（chronic anterior uveitis），因而需要請眼科醫師用 slit-lamp 檢查以確定其是否罹患 uveitis，達到早期發現早期治療的目的，請問下列何種 JIA 的亞型容易罹患慢性葡萄膜炎？
A. Polyarthritis-RF-negative
B. Polyarthritis-RF-positive
C. Systemic arthritis
D. Oligoarthritis-ANA-positive

正確答案：D. Oligoarthritis-ANA-positive